Clinical trial exclusion criterion:
Has a diagnosed additional malignancy within 3 years prior to first dose of study medication with the exception of curatively treated basal cell carcinoma of the skin, squamous cell carcinoma of the skin and/or curatively resected in situ cancers

Annotated entities:
- Condition: "malignancy"
- Qualifier: "additional"
- Temporal: "within 3 years prior to first dose of study medication"
- Reference_point: "first dose of study medication"
- Procedure: "treated"
- Qualifier: "curatively"
- Undefined_semantics: "curatively treated"
- Condition: "basal cell carcinoma of the skin"
- Condition: "squamous cell carcinoma of the skin"
- Condition: "in situ cancers"
- Procedure: "resected"
- Qualifier: "curatively"
- Qualifier: "curatively treated"
- Qualifier: "curatively resected"
- Negation: "with the exception of"